Symptoms for at least 3 months

The above is a clinical trial inclusion criterion. Annotated with entity spans:
[Condition: Symptoms] [Temporal: for at least 3 months]